Onset of symptoms < 3 hours prior to randomisation

The above is a clinical trial inclusion criterion. Annotated with entity spans:
[Observation: Onset of symptoms] [Temporal: < 3 hours prior to randomisation]